Clinical trial inclusion criterion:
Type B natriuretic peptide (BNP) >150 pg/ml (or pro-BNP [N-terminal-proBNP] = 600 pg / ml) or if the patient was hospitalized for cardiac decompensation within the preceding 12 months, BNP >100 pg/ml (or N-terminal-proBNP = 400 pg / ml)

Annotated entities:
- Measurement: "Type B natriuretic peptide (BNP)"
- Value: ">150 pg/ml"
- Measurement: "pro-BNP [N-terminal-proBNP]"
- Value: "= 600 pg / ml"
- Procedure: "hospitalized"
- Condition: "cardiac decompensation"
- Temporal: "within the preceding 12 months"
- Measurement: "BNP"
- Value: ">100 pg/ml"
- Measurement: "N-terminal-proBNP"
- Value: "= 400 pg / ml"